Ocular disorders in the study eye that may confound interpretation of study results

The above is a clinical trial exclusion criterion. Annotated with entity spans:
[Non-query-able: Ocular disorders in the study eye that may confound interpretation of study results]